Commitment to return for follow up visits

The above is a clinical trial inclusion criterion. Annotated with entity spans:
[Post-eligibility: Commitment to return for follow up visits]